Clinical trial exclusion criterion:
Sustained or symptomatic ventricular dysrhythmias uncontrolled by drug therapy or the use of an implantable defibrillator, and/or significant cardiac conduction defects, e.g., 2nd degree or 3rd degree AV block, or sick sinus syndrome, unless a functioning pacemaker is in place

Annotated entities:
- Qualifier: "symptomatic"
- Qualifier: "Sustained"
- Condition: "ventricular dysrhythmias"
- Qualifier: "uncontrolled by drug therapy"
- Procedure: "drug therapy"
- Drug: "drug"
- Device: "implantable defibrillator"
- Qualifier: "uncontrolled by the use of an implantable defibrillator"
- Qualifier: "significant"
- Condition: "cardiac conduction defects"
- Condition: "2nd degree AV block"
- Condition: "3rd degree AV block"
- Condition: "sick sinus syndrome"
- Negation: "unless"
- Qualifier: "functioning"
- Device: "pacemaker"